Clinical trial exclusion criterion:
Subjects who are already on treatment with TAC, cyclosporine or any other calcineurin inhibitor for over 4 weeks within the past 12 months.

Annotated entities:
- Drug: "TAC"
- Drug: "cyclosporine"
- Drug: "calcineurin inhibitor"
- Multiplier: "over 4 weeks"
- Temporal: "past 12 months."